Clinical trial inclusion criterion:
Healthy pregnant women age 18 to 50

Annotated entities:
- Condition: "Healthy"
- Condition: "pregnant"
- Person: "women"
- Person: "age"
- Value: "18 to 50"